有關猩紅熱（Scarlet fever）的敘述，下列何者錯誤？
A. 臨床上需與病毒疹、川崎氏症（Kawasaki disease）或是金黃色葡萄球菌感染區別
B. 猩紅熱的疹子摸起來有粗糙的感覺
C. 典型症狀亦包含草莓舌、全身性瀰漫紅疹、嘴唇周圍蒼白，數天後皮膚會脫屑
D. 猩紅熱的致病機轉和A群鏈球菌（Group A streptococcus）所產生的內毒素（Endotoxin）有關

正確答案：D. 猩紅熱的致病機轉和A群鏈球菌（Group A streptococcus）所產生的內毒素（Endotoxin）有關